Clinical trial inclusion criteria:
Women with singleton pregnancy.
History of preterm labor and/or midtrimester miscarriage in a previous pregnancy.
Cervical length of 15-25 mm by transvaginal sonography (TVS) at 16-24 weeks of gestation.

Annotated entities:
- Person: "Women"
- Condition: "singleton pregnancy"
- Condition: "preterm labor"
- Condition: "midtrimester miscarriage"
- Temporal: "previous"
- Condition: "pregnancy"
- Measurement: "Cervical length"
- Value: "15-25 mm"
- Procedure: "transvaginal sonography (TVS)"
- Value: "16-24 weeks"
- Measurement: "gestation"
- Temporal: "at 16-24 weeks of gestation"
- Reference_point: "16-24 weeks of gestation"